Adult acute myeloid leukemia

The above is a clinical trial inclusion criterion. Annotated with entity spans:
[Condition: Adult acute myeloid leukemia]